Clinical trial exclusion criterion:
Administration of the licensed MF59-containing vaccines, e.g. Fluad™ or Addigrip™ or virosome-based influenza vaccines such as Inflexal V™, InfectoVac Flu™ or Invivac™ during the 2006-2007 influenza season.

Annotated entities:
- Drug: "MF59-containing vaccines"
- Drug: "Fluad"
- Drug: "Addigrip"
- Drug: "virosome-based influenza vaccines"
- Drug: "Inflexal V"
- Drug: "InfectoVac Flu"
- Drug: "Invivac"
- Temporal: "during the 2006-2007 influenza season"